下列何者不附著在中軸骨骼上？
A. 胸大肌（Pectoralis major）
B. 胸小肌（Pectoralis minor）
C. 大圓肌（Teres major）
D. 前鋸肌（Serratus anterior）

正確答案：C. 大圓肌（Teres major）